Any confirmed or suspected immunosuppressive or immunodeficient condition based on medical history and physical

The above is a clinical trial exclusion criterion. Annotated with entity spans:
Any confirmed or suspected [Condition: immunosuppressive] or [Condition: immunodeficient condition] based on medical history and physical